Clinical trial inclusion criterion:
Patients with elective cesarean sections

Annotated entities:
- Qualifier: "elective"
- Procedure: "cesarean sections"